Clinical trial inclusion criterion:
Meets DSM-V criteria for current Alcohol Use Disorder

Entity relations:
- Has_value("DSM-V criteria", "Meets")
- AND("Alcohol Use Disorder", "DSM-V criteria")